Clinical trial exclusion criterion:
Chronic (longer than 14 days) administration of immunosuppressants or other immune-modifying drugs within 6 months before the first dose of investigational vaccine; oral corticosteroids in dosages of =0.5 mg/kg/d prednisolone or equivalent are excluded; inhaled or topical steroids are allowed

Entity relations:
- Subsumes("Chronic administration", "longer than 14 days")
- Has_qualifier("immune-modifying drugs", "other")
- Has_multiplier("immunosuppressants", "Chronic administration")
- multi("the first dose of investigational vaccine", "investigational vaccine")
- Has_index("within 6 months before the first dose of investigational vaccine", "the first dose of investigational vaccine")
- Has_value("dosages", "=0.5 mg/kg/d")
- Has_qualifier("=0.5 mg/kg/d", "prednisolone or equivalent")
- Has_multiplier("oral corticosteroids", "dosages")
- Has_negation("oral corticosteroids", "excluded")
- Has_temporal("immunosuppressants", "within 6 months before the first dose of investigational vaccine")
- AND("immunosuppressants", "oral corticosteroids")
- OR("immunosuppressants", "immune-modifying drugs")